With evidence of a local or systemic infection, including urinary tract infection

The above is a clinical trial exclusion criterion. Annotated with entity spans:
With evidence of a [Condition: local] or [Condition: systemic infection], including [Condition: urinary tract infection]